下列有關Mallory-Weiss tears之敘述，何者錯誤？
A. 常常需要外科手術止血
B. 可以用endoscope確診
C. 病人大部分為男性
D. 典型的位置位於胃小彎（lesser curvature）靠近食道與胃交界處（esophagogastric junction）

正確答案：A. 常常需要外科手術止血